Clinical trial inclusion criterion:
Type I diabetic patients

Annotated entities:
- Condition: "Type I diabetic"